Mitral or aortic valve stenosis greater than mild (ie, aortic stenosis: jet >3.0 meters per second [m/s], mean gradient >25 millimeters of mercury [mmHg], and aortic valve area <1.5 centimeters squared [cm^2]; mitral stenosis: mean gradient >5 mmHg and mitral valve area <1.5 cm^2)

The above is a clinical trial exclusion criterion. Annotated with entity spans:
[Condition: Mitral] or [Condition: aortic valve stenosis] [Qualifier: greater than mild] (ie, [Condition: aortic stenosis]: [Measurement: jet] [Value: >3.0 meters per second [m/s]], [Measurement: mean gradient] [Value: >25 millimeters of mercury [mmHg]], and [Measurement: aortic valve area] [Value: <1.5 centimeters squared [cm^2]]; [Condition: mitral stenosis]: [Measurement: mean gradient] [Value: >5 mmHg] and [Measurement: mitral valve area] [Value: <1.5 cm^2])